Which protein is involved in the organization and regulation of pluripotency-associated three-dimensional enhancer networks?

KLF4 is involved in the organization and regulation of pluripotency-associated three-dimensional enhancer networks.